一名剛診斷出貝賽特氏症（Behçet's disease）的病人，因視力模糊轉診至眼科，可預期其常見眼部病變為葡萄膜炎（uveitis）以及下列何者？
A. 白內障（cataract）
B. 視網膜血管炎（retinal vasculitis）
C. 角膜混濁（corneal opacity）
D. 眼瞼潰瘍（eyelid ulcer）

正確答案：B. 視網膜血管炎（retinal vasculitis）